more or equal to American Society of Anesthesiologist (ASA) class III

The above is a clinical trial exclusion criterion. Annotated with entity spans:
more or equal to [Measurement: American Society of Anesthesiologist (ASA) class] [Value: III]